Clinical trial exclusion criterion:
Known or suspected alcohol or substance abuse in the preceding 12 months.

Entity relations:
- Has_temporal("alcohol abuse", "preceding 12 months")
- OR("alcohol abuse", "substance abuse")